Clinical trial exclusion criterion:
7. Evidence of significant hepatic, hematologic, or immunologic impairment.

Entity relations:
- OR("hepatic impairment", "hematologic impairment", "immunologic impairment")